Describe PWMScan

pwmscan is a fast web-based tool to scan server-resident genomes for matches to a user-supplied pw or transcription factor binding site model from a public database.